下列何者為最易造成胎盤早期剝離（placental abruption）的原因？
A. 高血壓（hypertension）
B. 子宮肌瘤（leiomyoma）
C. 血栓形成（thrombophilia）
D. 抽菸（cigarette smoking）

正確答案：A. 高血壓（hypertension）